Clinical trial exclusion criterion:
Present alcoholism or drug abuse or use of medications that could interfere with the treatment including bronchodilators, quinolone antibiotics, monoamine oxidase inhibitors, anxiolytics, ranitidine, corticosteroids, growth hormone, antihypertensives.

Entity relations:
- Subsumes("medications that could interfere with the treatment", "bronchodilators")
- Subsumes("medications that could interfere with the treatment", "quinolone antibiotics")
- OR("quinolone antibiotics", "growth hormone", "corticosteroids", "ranitidine", "anxiolytics", "monoamine oxidase inhibitors", "antihypertensives")
- OR("alcoholism", "drug abuse", "medications that could interfere with the treatment")